Limited English proficiency (LEP)

The above is a clinical trial exclusion criterion. Annotated with entity spans:
[Observation: Limited English proficiency] ([Observation: LEP])